Clinical trial inclusion criterion:
ASA 1-2

Entity relations:
- Has_value("ASA", "1-2")